下列何者會通過坐骨小孔？
A. 臀小肌
B. 梨狀肌
C. 上孖肌
D. 閉孔內肌

正確答案：D. 閉孔內肌